Participation in another clinical ulcer-healing study within the last 4 weeks

The above is a clinical trial exclusion criterion. Annotated with entity spans:
[Non-query-able: Participation in another clinical ulcer-healing study within the last 4 weeks]